Clinical trial inclusion criterion:
Angiographically defined total occlusion over 3 months

Entity relations:
- Has_qualifier("total occlusion", "Angiographically defined")
- Has_temporal("total occlusion", "3 months")